Clinical trial inclusion criterion:
3. self-reported AT-related pain for at least 6 months and VAS (Visual Analog Scale) pain >5 (0-10 scale)

Entity relations:
- Has_value("VAS (Visual Analog Scale) pain", ">5")
- Has_qualifier("VAS (Visual Analog Scale) pain", "0-10 scale")
- Has_temporal("AT-related pain", "for at least 6 months")
- Has_context("VAS (Visual Analog Scale) pain", "self-reported")